Clinically significant new illness within 1 month before randomization that may affect the participant's ability to fulfill the study requirements or significantly confound the assessments

The above is a clinical trial exclusion criterion. Annotated with entity spans:
[Qualifier: Clinically significant] [Qualifier: new] [Condition: illness] [Temporal: within 1 month before randomization] that [Observation: may affect the participant's ability to fulfill the study requirements] or [Observation: significantly confound the assessments]